Clinical trial inclusion criterion:
Patients must complain of mild to moderate arthralgia.

Entity relations:
- Has_qualifier("arthralgia", "mild")
- OR("mild", "moderate")